Clinical trial exclusion criterion:
With evidence of intrinsic sphincter deficiency as defined by a maximal urethral closure pressure of <20 cm H2O

Annotated entities:
- Condition: "intrinsic sphincter deficiency"
- Measurement: "maximal urethral closure pressure"
- Value: "<20 cm H2O"